El aminoácido proteico cuya cadena lateral puede estar sin carga o cargada positivamente en las proximidades del pH neutro, dependiendo del entorno local, es:
1. Lisina.
2. Arginina.
3. Glutamina.
4. Histidina.

Respuesta correcta: 4. Histidina.